Signed informed consent

The above is a clinical trial inclusion criterion. Annotated with entity spans:
[Post-eligibility: Signed informed consent]